小腦損傷的患者走路時步態會有不穩（ataxia）的現象，相關之敘述何者錯誤？
A. 患者張開眼睛有助於增加步行穩定度
B. 肌肉無力（weakness）是引起步態障礙的主要因素
C. 小腦接收來自前庭系統（vestibular system）、骨骼肌、皮膚等感覺訊息
D. 患者可能合併有執行細緻動作（fine movement）的困難

正確答案：B. 肌肉無力（weakness）是引起步態障礙的主要因素